Clinical trial exclusion criterion:
13. Any condition(s) that, in the opinion of the investigator, might interfere with adherence to study requirements or evaluation of the study objectives

Annotated entities:
- Post-eligibility: "Any condition(s) that, in the opinion of the investigator, might interfere with adherence to study requirements or evaluation of the study objectives"